Clinical trial exclusion criterion:
QTc interval over 450 msec or risk factors for torsades de pointes or on Class IA and Class III anti arrhythmic medications

Entity relations:
- Has_value("QTc interval", "over 450 msec")
- OR("QTc interval", "Class IA anti arrhythmic medications", "risk factors for torsades de pointes", "Class III anti arrhythmic medications")